¿Cuál de los siguientes métodos anticonceptivos NO se considera de barrera?:
1. Preservativo femenino.
2. Diafragma con espermicida.
3. Capuchón cervical.
4. Dispositivo Intrauterino (DIU).

Respuesta correcta: 4. Dispositivo Intrauterino (DIU).